Clinical trial exclusion criterion:
Co-infection with hepatitis C virus, hepatitis D virus or human immunodeficiency virus (HIV)

Entity relations:
- Subsumes("human immunodeficiency virus", "HIV")
- Has_qualifier("Co-infection", "hepatitis C virus")
- OR("hepatitis C virus", "hepatitis D virus", "human immunodeficiency virus")